Clinical trial inclusion criterion:
age > 18 y.o.

Annotated entities:
- Person: "age"
- Value: "> 18 y.o"